Renal insufficiency (> 265 µmol/l)

The above is a clinical trial exclusion criterion. Annotated with entity spans:
[Condition: Renal insufficiency] [Non-representable: (> 265 µmol/l)]